Radical (total) cystectomy

The above is a clinical trial inclusion criterion. Annotated with entity spans:
[Procedure: Radical] ([Procedure: total]) cystectomy